Clinical trial inclusion criterion:
body mass index less than 30 kg/m2

Entity relations:
- Has_value("body mass index", "less than 30 kg/m2")